Which protein is affected by dusp8 activation?

dusp8 (M3/6) is a dual-specificity phosphatase selective for JNK.